How many disulfide bridges has the protein hepcidin got?

Hepcidin contains eight cysteine residues that form four disulfide bridges.